Which is the primary interacting protein of BLK?

Primary interacting protein of BLK is Cdk1-binding protein 1 (Bik1/Nbk1).